Clinical trial exclusion criterion:
In addition to the above, other diseases that the investigator judges to be inappropriate.

Annotated entities:
- Non-query-able: "In addition to the above, other diseases that the investigator judges to be inappropriate"